La mezcla etanol-agua presenta un azeótropo, esto significa que:
1. A partir de una concentración determinada, los dos líquidos son inmiscibles.
2. La mezcla presenta una temperatura mínima de codisolución.
3. Ambos componentes cumplen la ley de Raoult.
4. La mezcla se congela a una única temperatura.
5. Una vez alcanzada la composición azeotrópica, los dos líquidos no pueden separarse por destilación.

Respuesta correcta: 5. Una vez alcanzada la composición azeotrópica, los dos líquidos no pueden separarse por destilación.